¿Con qué criterio se agrupan los ligandos en la serie espectroquímica?:
1. Según la posición de su banda de absorción más intensa en su espectro electrónico.
2. Según la posición de su banda de absorción más intensa en su espectro infrarrojo.
3. Según la intensidad del campo cristalino que crean, de menor a mayor.
4. Según la intensidad del campo cristalino que crean, de mayor a menor.

Respuesta correcta: 3. Según la intensidad del campo cristalino que crean, de menor a mayor.